¿Cómo se denomina la tendencia a pensar que los demás se comportan como uno mismo en una determinada situación?
1. Selección perceptiva.
2. Error último de atribución.
3. Falso consenso.
4. Error egocéntrico de atribución.
5. Tendencias confirmatorias.

Respuesta correcta: 3. Falso consenso.